Previous participation in an HIV vaccine trial. Participants that were documented to have received only placebo are not excluded.

The above is a clinical trial exclusion criterion. Annotated with entity spans:
[Temporal: Previous] [Person: participation] in an [Observation: HIV vaccine trial]. [Person: Participants] that were documented to have received only [Procedure: placebo] are [Mood: not] excluded.